關於細菌基因形成 operon 的敘述，何者錯誤？
A. 通常由數個相關基因組成
B. 由一個 promoter 控制轉錄
C. 轉錄時不能同時進行基因的轉譯
D. 轉錄之 RNA 通常包含數個基因

正確答案：C. 轉錄時不能同時進行基因的轉譯